Donation blood or serum within 8 weeks before the first dose administration to a blood bank or blood donation center.

The above is a clinical trial exclusion criterion. Annotated with entity spans:
[Procedure: Donation blood] or serum [Temporal: within 8 weeks before] the [Reference_point: first dose administration] to a blood bank or blood donation center.